6. Hematocrit < 0.30

The above is a clinical trial exclusion criterion. Annotated with entity spans:
[Parsing_Error: 6.] [Measurement: Hematocrit] [Value: < 0.30]